Clinical trial exclusion criteria:
Cardiopulmonary arrest
Pregnancy
Severe right heart failure

Annotated entities:
- Condition: "Cardiopulmonary arrest"
- Condition: "Pregnancy"
- Condition: "right heart failure"
- Qualifier: "Severe"